Clinical trial exclusion criterion:
Lung resection or transplantation: Subjects with lung volume reduction surgery within the 12 months prior to Screening or having had a lung transplant.

Entity relations:
- Has_index("within the 12 months prior to Screening", "Screening")
- AND("having had a lung transplant", "lung transplant")
- AND("with lung volume reduction surgery", "lung volume reduction surgery")
- Subsumes("Lung resection", "within the 12 months prior to Screening")
- OR("Lung resection", "transplantation")
- OR("with lung volume reduction surgery", "having had a lung transplant")